Clinical trial inclusion criterion:
intramural leiomyomas with an ultrasonographic size <20 cm but >4cm,

Annotated entities:
- Condition: "intramural leiomyomas"
- Measurement: "ultrasonographic size"
- Value: "<20 cm but >4cm"